The Mantoux test detects what latent infection/disease?

screened for TB infection with a Mantoux tuberculin skin test.